Clinical trial exclusion criterion:
18. Any target lesion requires treatment with a device other than percutaneous transluminal coronary angioplasty (PTCA) prior to stent placement (e.g. but not limited to, directional coronary atherectomy, excimer laser, rotational atherectomy, etc.).

Entity relations:
- multi("device other than percutaneous transluminal coronary angioplasty (PTCA)", "percutaneous transluminal coronary angioplasty (PTCA)")
- Has_negation("percutaneous transluminal coronary angioplasty (PTCA)", "other than")
- multi("prior to stent placement", "stent placement")
- multi("stent placement", "stent placement")
- Subsumes("stent placement", "directional coronary atherectomy")
- AND("treatment", "device other than percutaneous transluminal coronary angioplasty (PTCA)")
- Has_temporal("treatment", "prior to stent placement")
- Has_mood("treatment", "requires")
- AND("target lesion", "treatment")
- OR("directional coronary atherectomy", "rotational atherectomy", "excimer laser")